Clinical trial exclusion criterion:
History of neuropathic pain, chronic pain syndrome, or preoperative use of narcotic or neuropathic pain medicine

Annotated entities:
- Condition: "neuropathic pain"
- Temporal: "History"
- Condition: "chronic pain syndrome"
- Temporal: "preoperative"
- Drug: "narcotic medicine"
- Drug: "neuropathic pain medicine"